Clinical trial exclusion criterion:
Non survivable injury

Entity relations:
- Has_qualifier("injury", "Non survivable")